The patient receive no anti-cancer treatment before primary surgery.

The above is a clinical trial inclusion criterion. Annotated with entity spans:
The patient receive [Negation: no] [Drug: anti-cancer treatment] [Temporal: before primary surgery].